HbA1c > 75 mmol/mol

The above is a clinical trial exclusion criterion. Annotated with entity spans:
[Measurement: HbA1c] [Value: > 75 mmol/mol]